La suma de las desviaciones de n medidas respecto al valor medio siempre es igual a:
1. 0,0.
2. 0,5.
3. 1,0.
4. -0,5.

Respuesta correcta: 1. 0,0.